¿Cuál de las siguientes opciones terapéuticas se considera actualmente la más eficaz para el tratamiento de una infección crónica de una artroplastia de cadera y conseguir una recuperación funcional?
1. Antibioterapia intravenosa durante tres semanas, seguida de antibioterapia oral durante seis semanas más.
2. Retirada de la prótesis infectada, desbridamiento quirúrgico, colocación de un espaciador, antibioterapia y pasado un tiempo colocación de una nueva prótesis.
3. Desbridamiento quirúrgico seguido de antibioterapia durante 12 semanas sin retirar la prótesis.
4. Tratamiento antibiótico más drenaje externo.

Respuesta correcta: 2. Retirada de la prótesis infectada, desbridamiento quirúrgico, colocación de un espaciador, antibioterapia y pasado un tiempo colocación de una nueva prótesis.